Clinical trial exclusion criterion:
11. Stroke still requiring neurological rehabilitation.

Entity relations:
- Has_qualifier("neurological rehabilitation", "requiring")